凝血酶原時間（Prothrombin time, PT）延長，但活化部分凝血活酶時間（activated partial thromboplastin time, aPTT）正常，最常是因為下列那一因子缺乏所造成？
A. Factor 8
B. Factor 9
C. Factor 7
D. Factor 11

正確答案：C. Factor 7